關於兒童肌性斜頸症（torticollis），下列敘述何者正確？①為胸鎖乳突肌纖維化所引起 ②臉部向患側旋轉受限制 ③對側臉部發育不良 ④皆須手術治療
A. ②④
B. ①③④
C. 僅①②
D. ①②③

正確答案：C. 僅①②